Clinical trial exclusion criterion:
currently use ventilator

Entity relations:
- Has_temporal("ventilator", "currently")